Clinical trial exclusion criterion:
Patients under chronic use of medications

Entity relations:
- Has_multiplier("medications", "chronic use")